Chica de 18 años de edad que acude al Hospital por edemas en miembros inferiores de 1 semana de evolución, destacando en la analítica una proteinuria     en    rango      nefrótico   con hipoproteinemia e hipoalbuminemia. En la anamnesis refiere aftas orales recidivantes, artritis de pequeñas articulaciones de las manos, rash malar y fotosensibilidad. En el estudio etiológico destaca la presencia de ANA y antiDNA        con     hipocomplementemia.        La determinación de ANCA es negativa. Se realiza una biopsia renal en la que podríamos encontrar cualquiera de estos tipos de glomerulonefritis, EXCEPTO:
1. GNF mesangial.
2. GNF necrotizante paucinmune.
3. GNF proliferativa focal.
4. GNF proliferativa difusa.
5. GNF membranosa.

Respuesta correcta: 2. GNF necrotizante paucinmune.